Male and females aged 18 to 70 years

The above is a clinical trial inclusion criterion. Annotated with entity spans:
[Person: Male] and [Person: females] [Person: aged] [Value: 18 to 70 years]